下列何者由下視丘所分泌？
A. LH（luteinizing hormone）
B. TSH（thyroid stimulating hormone）
C. Dopamine
D. Vasopressin

正確答案：C. Dopamine